Clinical trial inclusion criterion:
Age 18 - 75 years

Annotated entities:
- Person: "Age"
- Value: "18 - 75 years"